Clinical trial inclusion criterion:
Must have pathologically confirmed invasive adenocarcinoma or ductal carcinoma in situ of the breast.

Annotated entities:
- Procedure: "pathologically"
- Value: "confirmed"
- Condition: "invasive adenocarcinoma"
- Condition: "ductal carcinoma in situ"
- Qualifier: "of the breast"